Clinical trial inclusion criterion:
Non-radicular pain. Patients will be excluded if the pain radiates below the gluteal folds in a radicular pattern.

Entity relations:
- Has_qualifier("pain", "radicular")
- Has_negation("radicular", "Non")
- Has_qualifier("pain", "below the gluteal folds in a radicular pattern")
- Has_negation("pain", "excluded")